If a female of child-bearing potential, must have a negative pregnancy test.

The above is a clinical trial inclusion criterion. Annotated with entity spans:
If a [Person: female] of [Condition: child-bearing potential], must have a [Condition: negative] [Measurement: pregnancy test].